Clinical trial exclusion criterion:
Heart failure

Annotated entities:
- Condition: "Heart failure"